下列有關肺部 Nocardiasis 感染之敘述，何者正確？
A. Nocardia spp.是一種厭氧菌
B. 診斷可經由痰液培養得到結果
C. 常侵犯至肋膜、胸壁
D. 三分之二病人為女性

正確答案：C. 常侵犯至肋膜、胸壁